Ocular Surface Disease Index (OSDI) >12

The above is a clinical trial inclusion criterion. Annotated with entity spans:
[Measurement: Ocular Surface Disease Index] ([Measurement: OSDI]) [Value: >12]